Clinical trial exclusion criterion:
6. Coronary vessels with tortuosity or extremely calcified

Annotated entities:
- Parsing_Error: "6."
- Condition: "Coronary vessel tortuosity"
- Condition: "Coronary vessel extremely calcified"